Clinical trial exclusion criterion:
Abnormal thyroid stimulating hormone (TSH) or thyroxine (T4) levels on screening.

Entity relations:
- Has_value("thyroid stimulating hormone (TSH)", "Abnormal")
- Has_value("thyroxine (T4)", "Abnormal")
- Has_index("on screening", "screening")
- Has_temporal("thyroid stimulating hormone (TSH)", "on screening")
- Has_temporal("thyroxine (T4)", "on screening")
- OR("thyroid stimulating hormone (TSH)", "thyroxine (T4)")